History of hypersensitivity or adverse reaction to bupivacaine or narcotics

The above is a clinical trial exclusion criterion. Annotated with entity spans:
History of [Condition: hypersensitivity] or [Condition: adverse reaction] to [Drug: bupivacaine] or [Drug: narcotics]